Clinical trial exclusion criterion:
Bacterial infection origin from another organ (e.g. pneumonia)

Annotated entities:
- Condition: "Bacterial infection"
- Qualifier: "another organ"
- Condition: "pneumonia"